¿Cómo se denomina la distancia más próxima al ojo a la que se puede enfocar una imagen correctamente en la retina?:
1. Punto óptico lejano.
2. Profundidad de foco.
3. Punto cercano de acomodación.
4. Distancia focal.
5. Emetropía ocular.

Respuesta correcta: 3. Punto cercano de acomodación.